Si un test estadístico ofrece un valor p<0,05:
1. Se acepta la hipótesis nula.
2. Se rechaza la hipótesis alternativa.
3. Se rechaza la hipótesis nula.
4. No se puede rechazar la hipótesis nula.
5. No existe evidencia a favor de la hipótesis alternativa.

Respuesta correcta: 3. Se rechaza la hipótesis nula.